No measurable remaining vestibular function

The above is a clinical trial inclusion criterion. Annotated with entity spans:
[Negation: No] measurable [Measurement: remaining vestibular function]